R0, R1 resection

The above is a clinical trial inclusion criterion. Annotated with entity spans:
[Procedure: R0], [Procedure: R1 resection]